Presents with anxiety (Hamilton Anxiety Rating Scale = 18) at the time of study entry

The above is a clinical trial inclusion criterion. Annotated with entity spans:
Presents with [Condition: anxiety] ([Measurement: Hamilton Anxiety Rating Scale] [Value: = 18]) [Temporal: at the time of study entry]